Patients who are able to give informed consent.

The above is a clinical trial inclusion criterion. Annotated with entity spans:
[Informed_consent: Patients who are able to give informed consent].